What is the target of adalimumab?

Adalimumab is a monoclonal antibody that targets TNF-alpha, a central cytokine in the immune response in psoriasis that has been linked to autoimmune disease.